下列何者參與構成內弓狀纖維（internal arcuate fibers）？
A. 源自弓狀核（arcuate nucleus）的纖維
B. 脊髓丘腦徑（Spinothalamic tract）
C. 脊髓四疊體徑（Spinotectal tract）
D. 源自薄核（gracile nucleus）的纖維

正確答案：D. 源自薄核（gracile nucleus）的纖維